一位50歲男性前列腺癌病人接受前列腺根除手術，術後無法勃起，最可能受損的神經是：
A. 骨盆腔神經叢（pelvic plexus）
B. 海綿體神經（cavernous nerve）
C. 陰部神經（pudendal nerve）
D. 腹下神經（hypogastric nerve）

正確答案：B. 海綿體神經（cavernous nerve）